快速動眼期睡眠行為障礙（REM sleep behavior disorder）最常發生在下列那種病人？
A. 帕金森氏症（Parkinson's disease）
B. 阿茲海默症（Alzheimer's disease）
C. 額顳葉失智症（frontotemporal dementia）
D. 尿毒症（uremia）

正確答案：A. 帕金森氏症（Parkinson's disease）